Clinical trial exclusion criterion:
Pregnant or breast-feeding women

Entity relations:
- OR("Pregnant", "breast-feeding women")